Concurrent diagnosis of chronic obstructive pulmonary disease (COPD) or other respiratory disorders including active tuberculosis, lung cancer, bronchiectasis, sarcoidosis, lung fibrosis, pulmonary hypertension, interstitial lung diseases or other active pulmonary diseases.

The above is a clinical trial exclusion criterion. Annotated with entity spans:
Concurrent diagnosis of [Condition: chronic obstructive pulmonary disease (COPD)] or [Qualifier: other] [Condition: respiratory disorders] including [Qualifier: active] [Condition: tuberculosis], [Condition: lung cancer], [Condition: bronchiectasis], [Condition: sarcoidosis], [Condition: lung fibrosis], [Condition: pulmonary hypertension], [Condition: interstitial lung diseases] or [Qualifier: other] [Qualifier: active] [Condition: pulmonary diseases].